Clinical trial inclusion criterion:
18 to 50 years old

Entity relations:
- Has_value("old", "18 to 50 years")